Clinical trial exclusion criterion:
Patients with any active or uncontrolled infection, including known HIV infection. (Patients with active hepatitis B will be placed on lamivudine. Patients with active hepatitis C will be eligible if liver tests qualify (5.1.9)

Annotated entities:
- Qualifier: "uncontrolled"
- Qualifier: "active"
- Condition: "infection"
- Procedure: "HIV infection"
- Condition: "hepatitis B"
- Qualifier: "active"
- Drug: "lamivudine"
- Condition: "hepatitis C"
- Qualifier: "active"
- Measurement: "liver tests"
- Value: "qualify"